Clinical trial exclusion criterion:
Is participating in any other type of eye related clinical or research study

Annotated entities:
- Non-query-able: "Is participating in any other type of eye related clinical or research study"